Clinical trial exclusion criteria:
previous retinal vein occlusion.
any intraocular surgery within the previous 12 months.
myopia of > or = to 8 diopters.
active ocular or periocular infection
treatment with an investigational agent for any condition 60 days prior to enrollment.
evidence of severe cardiac disease.
clinically significant peripheral vascular disease (previous surgery, amputation, or symptoms of claudication)
uncontrolled hypertension (treated systolic blood pressure > 155 mmHg or diastolic blood pressure > 95 mmHg)
stroke within the preceding 12 months.

Annotated entities:
- Condition: "retinal vein occlusion"
- Temporal: "previous"
- Procedure: "intraocular surgery"
- Temporal: "within the previous 12 months"
- Condition: "myopia"
- Value: "> or = to 8 diopters"
- Condition: "periocular infection"
- Condition: "ocular infection"
- Qualifier: "active"
- Competing_trial: "treatment with an investigational agent for any condition 60 days prior to enrollment"
- Qualifier: "severe"
- Condition: "cardiac disease"
- Mood: "evidence of"
- Qualifier: "clinically significant"
- Condition: "peripheral vascular disease"
- Procedure: "previous surgery"
- Procedure: "amputation"
- Condition: "symptoms of claudication"
- Condition: "hypertension"
- Qualifier: "uncontrolled"
- Measurement: "systolic blood pressure"
- Qualifier: "treated"
- Value: "> 155 mmHg"
- Measurement: "diastolic blood pressure"
- Value: "> 95 mmHg"
- Condition: "stroke"
- Temporal: "within the preceding 12 months"